Clinical trial inclusion criterion:
AST and ALT = 80U/L

Entity relations:
- Has_value("AST", "= 80U/L")
- Has_value("ALT", "= 80U/L")